Chronic diseases requiring immune agents or hormone therapy

The above is a clinical trial exclusion criterion. Annotated with entity spans:
[Condition: Chronic diseases] requiring [Drug: immune agents] or [Procedure: hormone therapy]